Significant leucopenia, neutropenia, thrombocytopenia, anemia, or known bleeding diathesis

The above is a clinical trial exclusion criterion. Annotated with entity spans:
[Qualifier: Significant] [Condition: leucopenia], [Condition: neutropenia], [Condition: thrombocytopenia], [Condition: anemia], or known [Condition: bleeding diathesis]